一孕婦於妊娠時經常有尿糖陽性反應，生產前空腹血糖值為 250 mg/dL，她的新生兒出生後體重 4400 公克，該嬰兒出生後可能發生下列那一種併發症？
A. 高血鈣（hypercalcemia）
B. 高血鎂（hypermagnesemia）
C. 高血比容（polycythemia）
D. 高血糖（hyperglycemia）

正確答案：C. 高血比容（polycythemia）